Systemic corticotherapy or immunosuppressive treatment during the previous month, or local corticoid treatment the week before the patch testing.

The above is a clinical trial exclusion criterion. Annotated with entity spans:
[Procedure: Systemic corticotherapy] or [Procedure: immunosuppressive treatment] [Temporal: during the previous month], or [Procedure: local corticoid treatment] [Temporal: the week before] the patch testing.